Receipt of DTaP, IPV, PCV13, or Hib prior to enrollment. Previous administration of the first dose of HBV is permitted

The above is a clinical trial exclusion criterion. Annotated with entity spans:
Receipt of [Drug: DTaP], [Drug: IPV], [Drug: PCV13], or [Drug: Hib] [Temporal: prior to enrollment]. Previous administration of the first dose of HBV is permitted